Clinical trial exclusion criterion:
ongoing antibiotic treatment at the day of inclusion

Annotated entities:
- Procedure: "treatment"
- Drug: "antibiotic"
- Temporal: "at the day of inclusion"
- Reference_point: "day of inclusion"